Clinical trial inclusion criterion:
Horner's Syndrome

Annotated entities:
- Condition: "Horner's Syndrome"